Antepartum haemorrhage

The above is a clinical trial exclusion criterion. Annotated with entity spans:
[Condition: Antepartum haemorrhage]